Indicar cuál de los siguientes compuestos tiene acción antioxidante:
1. Vitamina B.
2. Vitamina D.
3. Vitamina E.
4. Todos los anteriores.
5. Ninguno de los anteriores.

Respuesta correcta: 3. Vitamina E.